Which tool exist for predicting drug synergy with deep learning?

DeepSynergy is an online tool for predicting drug synergy with deep learning. It is a method for predicting anti-cancer drug synergy based on a semi-supervised learning algorithm that is trained on a corpus of k-nearest neighbor data and combines pharmacological, structural and pharmacological features extracted from a large variety of biological datasets.